Clinical trial exclusion criteria:
Exclusion criteria includes ICUs with an average length of stay of less than 2 days;
HCA hospitals that are not able to transfer or merge data into the centralized data warehouse for the baseline and intervention periods of the study are also excluded.

Annotated entities:
- Visit: "ICUs"
- Measurement: "average length of stay"
- Value: "less than 2 days"
- Non-query-able: "HCA hospitals that are not able to transfer or merge data into the centralized data warehouse for the baseline and intervention periods of the study are also excluded."